甲狀腺機能亢進病人，何者較不宜以手術治療？
A. 藥物反應佳且甲狀腺無腫瘤
B. 年輕
C. 可能要懷孕
D. 甲狀腺機能亢進併凸眼病變

正確答案：A. 藥物反應佳且甲狀腺無腫瘤